Clinical trial exclusion criterion:
Serum potassium >5.4 mmol/L.

Annotated entities:
- Measurement: "Serum potassium"
- Value: ">5.4 mmol/L"